Clinical trial exclusion criterion:
Pregnant or lactating women.

Annotated entities:
- Pregnancy_considerations: "Pregnant or lactating women"